Clinical trial exclusion criterion:
Subjects who have any other condition which the investigator judges would make patients unsuitable for study participation

Annotated entities:
- Condition: "any other condition"
- Qualifier: "the investigator judges would make patients unsuitable for study participation"
- Subjective_judgement: "the investigator judges would make patients unsuitable for study participation"
- Undefined_semantics: "the investigator judges would make patients unsuitable for study participation"
- Context_Error: "the investigator judges would make patients unsuitable for study participation"